Clinical trial exclusion criterion:
initial blast crisis CML

Entity relations:
- Has_qualifier("CML", "blast crisis")